下列何者為肺炎鏈球菌（Streptococcus pneumoniae）、腦膜炎雙球菌（Neisseria meningitides）和流行性感冒嗜血桿菌（Haemophilus influenzae）引起細菌性腦膜炎共同的致病因子？
A. 蛋白質 A（protein A）
B. 內毒素（endotoxin）
C. β-內醯胺酶（β-lactamase）
D. 莢膜（capsule）

正確答案：D. 莢膜（capsule）